Clinical trial inclusion criterion:
Primary in-utero drug exposure was opioids other than buprenorphine

Entity relations:
- Has_qualifier("drug exposure", "in-utero")
- AND("drug exposure", "opioids")
- Has_negation("buprenorphine", "other")